Clinical trial exclusion criterion:
21. Renal or hepatic insufficiency

Annotated entities:
- Parsing_Error: "21."
- Condition: "hepatic insufficiency"
- Condition: "Renal insufficiency"